卵的第二次減數分裂（second meiotic division）何時完成？
A. 排卵前
B. 濾泡破裂排卵時
C. 精子穿透卵的細胞膜時
D. 著床後

正確答案：C. 精子穿透卵的細胞膜時